有關十二指腸潰瘍（duodenal ulcer），患者幽門竇（pyloric antrum）之黏膜層（mucosa）細胞的改變，下列何者正確？
A. 促胃酸激素細胞（gastrin-secreting cell）數目增加
B. 抑生長素細胞（somatostatin-secreting cell）數目增加
C. 壁細胞（parietal cell）之數目大量增加
D. 潘氏細胞（Paneth cell）數目大量增加

正確答案：B. 抑生長素細胞（somatostatin-secreting cell）數目增加